Drug/food allergy: Subjects with a history of hypersensitivity to any of the study medications (e.g. beta-agonists, corticosteroid) or components of the inhalation powder (e.g. lactose, magnesium stearate). In addition, patients with a history of severe milk protein allergy that, in the opinion of the study physician, contraindicates the subject's participation will also be excluded.

The above is a clinical trial exclusion criterion. Annotated with entity spans:
[Condition: Drug]/[Condition: food allergy]: Subjects with a history of [Condition: hypersensitivity] to any of the [Drug: study medications] (e.g. [Drug: beta-agonists], [Drug: corticosteroid]) or [Drug: components of the inhalation powder] (e.g. [Drug: lactose], [Drug: magnesium stearate]). In addition, patients with a [Temporal: history] of [Qualifier: severe] [Condition: milk protein allergy] that, [Subjective_judgement: in the opinion of the study physician, contraindicates the subject's participation will also be excluded].